Clinical trial exclusion criterion:
Non-diabetic ulcers Orthopedic or neuromuscular pathologic conditions

Entity relations:
- Has_qualifier("ulcers", "Non-diabetic")
- OR("Orthopedic pathologic conditions", "neuromuscular pathologic conditions")